一位 35 歲男性不慎從三樓跌落一樓，導致左耳嚴重出血，同時有顏面神經麻痺，最可能為下列何項診斷？
A. 顳骨骨折（petrosal bone fracture）
B. 顳顎關節移位（T-M joint dislocation）
C. 內淋巴漏（endolymphatic leakage）
D. 外耳道蜂窩性組織炎（external ear canal cellulitis）

正確答案：A. 顳骨骨折（petrosal bone fracture）